Clinical trial exclusion criterion:
Active hepatitis virus infection

Annotated entities:
- Condition: "hepatitis virus infection"
- Temporal: "Active"